Clinical trial exclusion criterion:
Patients sensitive to chemicals used to induce sweating

Annotated entities:
- Condition: "sensitive to chemicals used to induce sweating"
- Undefined_semantics: "sensitive to chemicals used to induce sweating"